Clinical trial exclusion criterion:
7. Use of oral contraceptives in the preceding 2 weeks. Use of Depo-Provera® in the preceding 10 months.

Entity relations:
- Has_temporal("oral contraceptives", "in the preceding 2 weeks")
- Has_temporal("Depo-Provera®", "in the preceding 10 months")